What disease is small bowel lymphoma commonly associated with

Small bowel lymphoma is commonly associated with celiac disease.